Subject has provided informed consent.

The above is a clinical trial inclusion criterion. Annotated with entity spans:
[Non-query-able: Subject has provided informed consent.]